Clinical trial inclusion criterion:
Inability to take aspirin at a dosage of 100 mg or less

Annotated entities:
- Condition: "Inability to take"
- Drug: "aspirin"
- Multiplier: "100 mg or less"